Clinical trial exclusion criterion:
Patients with documented allergies to propofol, dexmedetomidine, fentanyl, eggs or egg products, or soy or soy products.

Entity relations:
- AND("allergies", "propofol")
- OR("propofol", "dexmedetomidine", "fentanyl", "eggs", "egg products", "soy", "soy products")